5. Women with a history of PCOS

The above is a clinical trial exclusion criterion. Annotated with entity spans:
[Parsing_Error: 5.] [Person: Women] with a [Temporal: history] of [Condition: PCOS]